Current treatment with a dopamine agonist

The above is a clinical trial exclusion criterion. Annotated with entity spans:
[Temporal: Current] treatment with a [Drug: dopamine agonist]